Clinical trial inclusion criterion:
Patients aged of 18 and over,

Entity relations:
- Has_value("aged", "18 and over")